15. Female subject is pregnant or plan to become pregnant

The above is a clinical trial exclusion criterion. Annotated with entity spans:
15. [Person: Female] subject is [Condition: pregnant] or [Mood: plan] to become [Condition: pregnant]